refusal of insulin

The above is a clinical trial exclusion criterion. Annotated with entity spans:
[Condition: refusal] of [Drug: insulin]